Clinical trial exclusion criterion:
Any condition other than coronary artery disease with a life expectancy <12 months

Entity relations:
- Has_negation("coronary artery disease", "other than")
- AND("condition", "coronary artery disease")
- Has_value("life expectancy", "<12 months")
- Has_context("condition", "life expectancy")